下列何者不是肝腦病變（hepatic encephalopathy）的誘發因素？
A. 感染
B. 高蛋白飲食
C. 低血鉀
D. 靜脈注射支鏈氨基酸（branch-chained amino acid）溶液

正確答案：D. 靜脈注射支鏈氨基酸（branch-chained amino acid）溶液